Clinical trial exclusion criterion:
In the opinion of the investigator, the volunteer is unlikely to comply with the study protocol

Annotated entities:
- Post-eligibility: "In the opinion of the investigator, the volunteer is unlikely to comply with the study protocol"